Clinical trial exclusion criterion:
A biologic medicine used within the previous 6 months

Entity relations:
- Has_temporal("biologic medicine", "within the previous 6 months")